Clinical trial exclusion criterion:
History of renal calculi

Entity relations:
- Has_temporal("renal calculi", "History")